Clinical trial inclusion criterion:
No change to AD medications within the month preceding randomization, including starting, stopping, or dosage modifications

Entity relations:
- Has_index("within the month preceding randomization", "randomization")
- Has_negation("change to AD medications", "No")
- AND("change to AD medications", "AD medications")
- Has_temporal("change to AD medications", "within the month preceding randomization")